Clinical trial exclusion criterion:
Patient not expected to survive more than 4 days

Annotated entities:
- Observation: "survive"
- Negation: "not"
- Value: "more than 4 days"